PCOS patients

The above is a clinical trial exclusion criterion. Annotated with entity spans:
[Condition: PCOS] patients